陳先生 62 歲，除患有糖尿病多年外，身體一向健康。某日午餐後返辦公室，突然感到胸痛不適。同事將陳先生送入醫院急診室，初步判斷為急性冠狀症候群（acute coronary syndrome）。住院一星期後病情穩定，各器官功能正常。經心導管檢查，發現冠狀動脈阻塞情況如下：左冠狀動脈主幹（left main coronary artery）80%狹窄、左冠狀動脈左前降支近心端 76%狹窄與中段 70%狹窄、左迴旋支中段 65%狹窄、右冠狀動脈中段 83%狹窄與遠心端 90%狹窄。經心臟內外科團隊討論後，建議陳先生接受下列何種後續治療的一年存活率最好？
A. 經皮穿徑冠狀動脈血管整形術（percutaneous transluminal coronary angioplasty）
B. 經皮穿徑冠狀動脈血管整形術及冠狀動脈支架置放術（percutaneous transluminal coronary angioplasty
C. 冠狀動脈繞道術（coronary artery bypass grafting）
D. 藥物治療

正確答案：C. 冠狀動脈繞道術（coronary artery bypass grafting）